Clinical trial exclusion criterion:
Acute abdomen, patient who has diagnosed paralytic ileus or suspicious ileus

Entity relations:
- OR("Acute abdomen", "suspicious ileus", "paralytic ileus")